El ácido linolénico (18:39, 12, 15) es un ácido graso:
1. Poliinsaturado.
2. Saturado.
3. Polisaturado.
4. Con triple enlace.
5. Ramificado.

Respuesta correcta: 1. Poliinsaturado.